Clinical trial exclusion criterion:
Hormone therapy < 7 days prior to randomization.

Annotated entities:
- Procedure: "Hormone therapy"
- Temporal: "< 7 days prior to randomization"
- Reference_point: "randomization"